長骨（long bone）的軟骨內骨化（endochondral ossification）的初級骨化中心（primary ossification center）位於何處？
A. 骨幹（diaphysis）
B. 骨骺（epiphysis）
C. 骨幹骺端（metaphysis）
D. 骨內膜（endosteum）

正確答案：A. 骨幹（diaphysis）